HLA-A2 melanoma patients with :

The above is a clinical trial inclusion criterion. Annotated with entity spans:
[Qualifier: HLA-A2] [Condition: melanoma] patients with :